Varón de 70 años que presenta en una analítica de rutina 29.000 leucocitos/mm3, 180.000 plaquetas/mm3 y 15g/dL de hemoglobina. En la exploración no se observan adenopatías ni organomegalias. En la extensión de la sangre periférica se detectan numerosas sombras de Gumprecht. ¿Cuál es el diagnóstico más probable?:
1. Gammapatía monoclonal de significado incierto.
2. Infección vírica.
3. Síndrome mielodisplásico.
4. Leucemia linfoide crónica.

Respuesta correcta: 4. Leucemia linfoide crónica.